Clinical trial exclusion criterion:
Renal insufficiency (Creatinine clearance < 30 mL/min)

Annotated entities:
- Condition: "Renal insufficiency"
- Measurement: "Creatinine clearance"
- Value: "< 30 mL/min"